某人主訴有頭痛、發燒、全身疲勞、寒顫、噁心、嘔吐、頸部僵硬、肌肉關節疼痛及淋巴腺腫脹等症狀，經問診後發現，該人於一星期前曾參加登山活動，露宿野地；回來後發現身上有蟲子叮咬所留下來的紅斑，後來紅斑以圈狀向外擴散，變成遊走性紅斑（erythema migrans），此患者有可能是被何致病原感染？
A. 恙蟲病立克次氏菌（Orientia tsutsugamushi）
B. 布魯氏菌（Brucella）
C. 伯氏疏螺旋菌（Borrelia burgdorferi）
D. 鉤端螺旋體（Leptospira interrogans）

正確答案：C. 伯氏疏螺旋菌（Borrelia burgdorferi）